一位 16 歲男性病人，因右臉頰一個逐漸長大之腫瘤來求診，病人在臉上有一些雀斑，在兩側腋下則有一些咖啡色之斑點，最有可能之診斷是下列何者？
A. Gorham Stout disease
B. neurofibromatosis
C. fibrous dysplasia
D. Crouzon's disease

正確答案：B. neurofibromatosis